Satisfies any contraindications or restrictions to Dapsone therapy as listed in the product labels.

The above is a clinical trial exclusion criterion. Annotated with entity spans:
Satisfies any [Condition: contraindications] or restrictions to [Drug: Dapsone] therapy as listed in the product labels.